Clinical trial inclusion criterion:
women postmenopausal for 12 months before the study, surgically sterile, or not pregnant and on effective contraception.

Annotated entities:
- Pregnancy_considerations: "women postmenopausal for 12 months before the study, surgically sterile, or not pregnant and on effective contraception."